氣管內管插管（endotracheal tube intubation）過程往往容易有併發症的發生，學界提出了處置過程中應該遵循的四大原則，以減少氣管內管插管相關併發症的發生或是降低其嚴重程度。此四大原則，何者的優先性被列為最高？
A. 預防外傷原則（prevent trauma）／插管前必須將所有預防外傷的條件最佳化（optimization），避免插管所導致的外傷
B. 充分充氧原則（oxygenation）／插管前必須進行前給氧（preoxygenation），插管之間應以面罩通氣方式給氧
C. 備份計畫原則（backup plans）／開始插管之前就應準備好應變的備份計畫，包括終止插管與取消手術在內
D. 儘速求救原則（call for help）／插管過程若遇到任何處置上的困難，就應該立即尋求所有可能的協助

正確答案：B. 充分充氧原則（oxygenation）／插管前必須進行前給氧（preoxygenation），插管之間應以面罩通氣方式給氧